Clinical trial inclusion criterion:
The breast tumor's positive ER/PR rate is <1%, and positive ER-beta1 rate is =10% by IHC.

Annotated entities:
- Condition: "breast tumor"
- Measurement: "positive ER/PR rate"
- Value: "<1%"
- Measurement: "positive ER-beta1 rate"
- Value: "=10%"
- Procedure: "IHC"